Which syndrome is caused by deletion of Pds5b in mice?

Mice lacking sister chromatid cohesion protein PDS5B exhibit developmental abnormalities reminiscent of Cornelia de Lange syndrome